Clinical trial inclusion criterion:
Has an ASDAS >= 2.1 at Screening

Annotated entities:
- Measurement: "ASDAS"
- Value: ">= 2.1"
- Temporal: "at Screening"